Skin lesions or lesions that have been biopsied previously

The above is a clinical trial exclusion criterion. Annotated with entity spans:
[Condition: Skin lesions] or [Condition: lesions] that have been [Procedure: biopsied] [Temporal: previously]